Clinical trial inclusion criterion:
Age= 18 years and less than 70 years.

Annotated entities:
- Person: "Age"
- Value: "= 18 years and less than 70 years"